Clinical trial inclusion criterion:
Patients aged between 40 and 60 years old.

Entity relations:
- Has_value("aged", "between 40 and 60 years old")